真核細胞核內的一種纖維狀物質，其由一整套基因體 DNA 與蛋白質所構成，具調控基因表現的功能。該構造的名稱為何？
A. 染色質（chromatin）
B. 中心粒（centrosome）
C. 基因（gene）
D. 核小體（nucleosome）

正確答案：A. 染色質（chromatin）